海洛因成癮的個案通常較容易合併那一種第二軸診斷？
A. 妄想性人格障礙症（paranoid personality disorder）
B. 反社會人格障礙症（antisocial personality disorder）
C. 自戀性人格障礙症（narcissistic personality disorder）
D. 依賴性人格障礙症（dependent personality disorder）

正確答案：B. 反社會人格障礙症（antisocial personality disorder）